Clinical trial exclusion criteria:
planned surgical duration more than 3 hours
contraindication to spinal anaesthesia
severe respiratory disease
patient known and treated for sleep apnea syndrome

Annotated entities:
- Measurement: "planned surgical duration"
- Value: "more than 3 hours"
- Condition: "contraindication"
- Procedure: "spinal anaesthesia"
- Qualifier: "severe"
- Condition: "respiratory disease"
- Condition: "sleep apnea syndrome"
- Procedure: "treated"